Clinical trial inclusion criterion:
forced expiratory volume in 1s : forced vital capacity ratio > 0.75

Annotated entities:
- Measurement: "forced expiratory volume in 1s : forced vital capacity ratio"
- Value: "> 0.75"